一輛學校校車和卡車對撞後，一位6歲小孩被送到急診室，這時小孩已生命垂危，但是二次施打周邊靜脈都失 ，此時最佳給予輸液路徑為：
A. 建立一個腹內導管（intraperitoneal catheter）
B. 脛骨的骨內針置入術（intraosseous cannulation）
C. 建立中心靜脈導管
D. 繼續嘗試建立周邊的靜脈導管

正確答案：B. 脛骨的骨內針置入術（intraosseous cannulation）